Neuromyelitis optica

The above is a clinical trial exclusion criterion. Annotated with entity spans:
[Condition: Neuromyelitis optica]